age <45 or >80

The above is a clinical trial exclusion criterion. Annotated with entity spans:
[Person: age] [Value: <45 or >80]